Clinical trial exclusion criterion:
Body Mass Index (BMI) of > 32

Entity relations:
- Subsumes("Body Mass Index", "BMI")
- Subsumes("Body Mass Index", "> 32")